Clinical trial inclusion criterion:
=32 weeks gestational age at birth

Entity relations:
- Has_value("gestational age at birth", "=32 weeks")